Patient is currently enrolled in a Novartis OGD or GMA-sponsored or Incyte-sponsored clinical study (where Incyte can delegate the sponsorship to a preferred CRO, if applicable) that is approved to enroll into this rollover study, is receiving ruxolitinib and has fulfilled all of the requirements of the parent protocol.

The above is a clinical trial inclusion criterion. Annotated with entity spans:
[Competing_trial: Patient is currently enrolled in a Novartis OGD or GMA-sponsored or Incyte-sponsored clinical study (where Incyte can delegate the sponsorship to a preferred CRO, if applicable) that is approved to enroll into this rollover study, is receiving ruxolitinib and has fulfilled all of the requirements of the parent protocol.]